12. Any serious acute, chronic or progressive disease

The above is a clinical trial exclusion criterion. Annotated with entity spans:
12. [Subjective_judgement: Any serious acute, chronic or progressive disease]